Psychiatric disorders

The above is a clinical trial exclusion criterion. Annotated with entity spans:
[Condition: Psychiatric disorders]